Clinical trial inclusion criterion:
sedentary or insufficiently active;

Entity relations:
- OR("sedentary", "insufficiently active")